Presenta cadena J en su estructura:
1. IgM.
2. IgG.
3. IgD.
4. IgE.

Respuesta correcta: 1. IgM.